下列cephalosporins中，何者可做為手術前（如頭頸部、心臟血管及胸腔、開顱手術等）預防性感染的首選藥物？
A. cefazolin
B. cefepime
C. ceftazidime
D. ceftriaxone

正確答案：A. cefazolin